Clinical trial exclusion criterion:
Acetylsalicyclic acid (ASA) treatment >1g/day or regular use of Non steroidal anti-inflammatory drug (NSAIDs)

Entity relations:
- Has_value("Acetylsalicyclic acid (ASA) treatment", ">1g/day")
- OR("Acetylsalicyclic acid (ASA) treatment", "Non steroidal anti-inflammatory drug (NSAIDs)")